¿Cuál de los siguientes elementos químicos se considera un micronutriente (elemento traza) para los microorganismos?:
1. Azufre.
2. Carbono.
3. Nitrógeno.
4. Zinc.

Respuesta correcta: 4. Zinc.